下列何種藥物具有抑制xanthine oxidase，用於治療慢性痛風？
A. Febuxostat
B. Probenecid
C. Sulfinpyrazone
D. Colchicine

正確答案：A. Febuxostat